Clinical trial inclusion criterion:
1. Patients ≥ 18 years-old from "Instituto Teletón Santiago" and "Hospital Clínico Mutual de seguridad".

Entity relations:
- Has_value("years-old", "≥ 18 years")
- OR("Instituto Teletón Santiago", "Hospital Clínico Mutual de seguridad")